El efecto tóxico de la antimicina y del cianuro se debe a su interacción con:
1. Los sistemas de transporte de los ácidos grasos al interior de la mitocondria.
2. Los citocromos de la cadena de transporte electrónico mitocondrial.
3. Las enzimas de la glucolisis.
4. Las enzimas deshidrogenasas del ciclo del ácido cítrico.
5. Las enzimas que catalizan la replicación del ADN.

Respuesta correcta: 2. Los citocromos de la cadena de transporte electrónico mitocondrial.